HBsAg positive or HBcAb negative or hepatitis B virus DNA positive at baseline

The above is a clinical trial exclusion criterion. Annotated with entity spans:
[Condition: HBsAg positive] or [Condition: HBcAb negative] or [Condition: hepatitis B virus DNA positive] [Temporal: at baseline]